No known history of seizure activity.

The above is a clinical trial exclusion criterion. Annotated with entity spans:
[Negation: No] known [Temporal: history] of [Condition: seizure activity].